Hunt Hess Grade 5 SAH

The above is a clinical trial exclusion criterion. Annotated with entity spans:
[Measurement: Hunt Hess Grade] [Value: 5] [Condition: SAH]